兩眼同時看向正上方，為何種神經之作用？
A. 眼神經（ophthalmic nerve）
B. 滑車神經（trochlear nerve）
C. 動眼神經（oculomotor nerve）
D. 外展神經（abducent nerve）

正確答案：C. 動眼神經（oculomotor nerve）